Ultrasound confirmed complete mole

The above is a clinical trial inclusion criterion. Annotated with entity spans:
[Procedure: Ultrasound] confirmed [Condition: complete mole]